Clinical trial exclusion criterion:
Candidate for topical anti-inflammatory

Annotated entities:
- Mood: "Candidate for"
- Drug: "topical anti-inflammatory"